一位 62 歲男性，體重 60 kg，於下午二點來急診，主訴為今天凌晨開始解血便。病患臉色略為蒼白，自覺站立時會頭暈，全身虛弱，到院時躺在病床上測量之心跳是每分鐘 110 下，血壓為 120/60 mmHg。 下列那一項是最不需要立即進行的處置？
A. 詢問病史及症狀，理學檢查
B. 給予氧氣、輸液，抽血檢查
C. 放置鼻胃管，並以清水沖洗胃部
D. 腹部 X 光攝影

正確答案：D. 腹部 X 光攝影